Clinical trial inclusion criterion:
Absolute neutrophil count ≥ 1,000/mcL

Entity relations:
- Has_value("Absolute neutrophil count", "≥ 1,000/mcL")